Clinical trial inclusion criterion:
Obtained informed consent

Annotated entities:
- Post-eligibility: "Obtained informed consent"